透納氏症候群（Turner syndrome）患童很少出現下列那一種先天性心臟異常？
A. bicuspid aortic valve
B. aortic stenosis
C. aortic coarctation
D. pulmonary stenosis

正確答案：D. pulmonary stenosis